Clinical trial exclusion criterion:
Any history of cervical, penile, oral or anal cancers

Entity relations:
- OR("penile cancers", "oral cancers", "anal cancers", "cancers cervical")